Clinical trial inclusion criterion:
Able to provide written informed consent and to comply with study procedures.

Annotated entities:
- Non-query-able: "Able to provide written informed consent and to comply with study procedures."